En sus orígenes, la técnica de Desensibilización Sistemática fue explicada a partir de:
1. Condicionamiento operante.
2. Condicionamiento en un solo ensayo.
3. Condicionamiento clásico.
4. Condicionamiento vicario.
5. Condicionamiento instrumental.

Respuesta correcta: 3. Condicionamiento clásico.